Persistent, unresolved NCI CTCAE v4.0 ≥ Grade 2, previous drug-related toxicity (except alopecia, erectile impotence, hot flashes, libido, neuropathy).

The above is a clinical trial exclusion criterion. Annotated with entity spans:
Persistent, unresolved [Measurement: NCI CTCAE v4.0] [Value: ≥ Grade 2], [Temporal: previous] [Condition: drug-related toxicity] ([Negation: except] [Condition: alopecia], [Condition: erectile impotence], [Condition: hot flashes], [Condition: libido], [Condition: neuropathy]).